Clinical trial exclusion criterion:
Allergy to gabapentin, acetaminophen, codeine, or ibuprofen

Annotated entities:
- Condition: "Allergy"
- Drug: "gabapentin"
- Drug: "acetaminophen"
- Drug: "codeine"
- Drug: "ibuprofen"